下列有關自體免疫疾病及其自體抗原的配對中，何者最為正確？
A. multiple sclerosis-myelin-basic protein
B. rheumatoid arthritis-F-actin
C. autoimmune hepatitis-collagen type Ⅱ
D. Sjögren's syndrome-deoxyribonucleoprotein

正確答案：A. multiple sclerosis-myelin-basic protein